Clinical trial exclusion criterion:
are under 19 years old

Annotated entities:
- Value: "under 19 years"
- Person: "old"